有關正常人類囊胚（Blastocyst）之敘述，何者錯誤？
A. 開始是在輸卵管窄狹部及壺部相接觸發育
B. 停留在子宮腔的內分泌中約 72 小時再著床
C. 著床前必須由透明帶（Zona pellucida）孵出
D. 囊胚著床前已分化成內細胞團（Inner cell mass）及滋胚外層（Trophectoderm）

正確答案：A. 開始是在輸卵管窄狹部及壺部相接觸發育